Blood pressure taken at screening and randomization is = 180 mmHg for siSBP or = 110 mmHg for siDBP.

The above is a clinical trial exclusion criterion. Annotated with entity spans:
[Measurement: Blood pressure] taken [Temporal: at screening] and randomization is [Value: = 180 mmHg] for [Measurement: siSBP] or [Value: = 110 mmHg] for [Measurement: siDBP].